What effect does azeliragon have on RAGE?

Azeliragon is an inhibitor of receptor for advanced glycation end products (RAGE).